Active malignant (p.e. any kind of cancer) or treated disease, to which the individual may relapse during the study;

The above is a clinical trial exclusion criterion. Annotated with entity spans:
[Temporal: Active] [Condition: malignant] (p.e. [Qualifier: any kind] of [Condition: cancer]) or [Condition: treated disease], [Subjective_judgement: to which the individual may relapse during the study];